下列有關於腦下垂體腺瘤（pituitary adenoma）的敘述，何者為非？
A. 直徑小於 1 cm 的稱為微小腺瘤（microadenoma）
B. 最常見的腺瘤為泌乳激素瘤
C. 在一般磁振造影檢查，微小的腺瘤會出現明顯的顯影
D. 造成肢端肥大的腺瘤是生長激素分泌腺瘤

正確答案：C. 在一般磁振造影檢查，微小的腺瘤會出現明顯的顯影